Bowel obstruction

The above is a clinical trial exclusion criterion. Annotated with entity spans:
[Condition: Bowel obstruction]